Diamond Blackfan anemia;

The above is a clinical trial exclusion criterion. Annotated with entity spans:
[Condition: Diamond Blackfan anemia];